Any condition that prevents participation in the study, including pregnancy and other contraindications for Ventavis treatment (as listed in the current Ventavis Summary of Product Characteristics and patient package insert)

The above is a clinical trial exclusion criterion. Annotated with entity spans:
Any condition that prevents participation in the study, including [Condition: pregnancy] and other [Condition: contraindications] for [Procedure: Ventavis treatment] (as listed in the current [Qualifier: Ventavis Summary of Product Characteristics and patient package insert])